Clinical trial exclusion criterion:
ocular surgery within the past 3 mouths

Entity relations:
- Has_temporal("ocular surgery", "within the past 3 mouths")